Creatinen in blood = 3mg/dl

The above is a clinical trial inclusion criterion. Annotated with entity spans:
[Measurement: Creatinen] in blood [Value: = 3mg/dl]